Associated with CNS (central nervous system) metastases;

The above is a clinical trial exclusion criterion. Annotated with entity spans:
Associated with CNS (central nervous system) [Condition: metastases];